形成尿路結石理論中之 fixed particle 假說，其結石結晶體附著於何處？
A. 腎絲球
B. 腎小管
C. 腎盞
D. 腎盂

正確答案：B. 腎小管